Clinical trial inclusion criterion:
Diagnosis of MS according to the McDonald criteria 2010 and cranial MRI scan demonstrating white matter lesions attributable to MS within 10 years before Screening

Annotated entities:
- Condition: "MS"
- Measurement: "McDonald criteria 2010"
- Procedure: "cranial MRI scan"
- Temporal: "within 10 years before Screening"